El diagnóstico enfermero “Trastorno de la imagen corporal” pueden presentarlo personas con cambios tegumentarios y de redistribución de los depósitos de grasa, asociados a:
1. Embarazo.
2. Hiperaldosteronismo.
3. Diabetes insípida.
4. Enfermedad de Addison.
5. Síndrome de Cushing.

Respuesta correcta: 5. Síndrome de Cushing.